Clinical trial exclusion criterion:
History of ischemic cerebrovascular disorders (e.g., stroke, transient ischemic attack) or ischemia of the spinal cord

Entity relations:
- Subsumes("ischemic cerebrovascular disorders", "stroke")
- OR("stroke", "transient ischemic attack")
- OR("ischemic cerebrovascular disorders", "ischemia of the spinal cord")